Clinical trial exclusion criterion:
History of bleeding diathesis or known coagulopathy (including heparin-induced thrombocytopenia), or refuses blood transfusions.

Annotated entities:
- Condition: "bleeding diathesis"
- Temporal: "History"
- Condition: "coagulopathy"
- Condition: "heparin-induced thrombocytopenia"
- Observation: "refuses blood transfusions"
- Procedure: "blood transfusions"